在肛門直腸連接處（anorectal junction）的位置，會觀察到下列何項構造？
A. 直腸（rectum）上皮有許多杯狀細胞（goblet cells）
B. 直腸（rectum）上皮為複層扁平上皮（stratified squamous epithelium）
C. 肛門（anus）有Peyer's patch
D. 肛門（anus）肌外層的縱走肌肉（longitudinal layer of muscularis externa）有顯著加厚作為內括約肌

正確答案：A. 直腸（rectum）上皮有許多杯狀細胞（goblet cells）